Previous CABG

The above is a clinical trial exclusion criterion. Annotated with entity spans:
Previous [Procedure: CABG]